Cholesterol total > 300 mg/dl with or without use of statin;

The above is a clinical trial exclusion criterion. Annotated with entity spans:
[Measurement: Cholesterol total] [Value: > 300 mg/dl] with or without use of [Drug: statin];